Contiene abundante glucógneo:
1. Hepatocitos.
2. Células plasmáticas.
3. Linfocitos.
4. Células cebadas.
5. Fibroblastos.

Respuesta correcta: 1. Hepatocitos.